下列何種寄生蟲之感染，其幼蟲在人體內移行（migration）不會經過肺臟？①糞小桿線蟲（Strongyloides stercoralis） ②蟯蟲（Enterobius vermicularis） ③鞭蟲（Trichuris trichiura）
A. 僅①②
B. 僅①③
C. 僅②③
D. ①②③

正確答案：C. 僅②③